Clinical trial inclusion criterion:
ASA class 1 to 3 patients

Entity relations:
- Has_value("ASA class", "1 to 3")